腓深神經（deep fibular nerve）傷害，最可能導致下列何者無力？
A. 腓長肌（fibularis longus）
B. 腓短肌（fibularis brevis）
C. 脛前肌（tibialis anterior）
D. 脛後肌（tibialis posterior）

正確答案：C. 脛前肌（tibialis anterior）